Clinical trial exclusion criterion:
No concurrent use of isoniazid, labetolol, trovafloxacin, tolcapone, and felbamate

Entity relations:
- Has_negation("isoniazid", "No")
- OR("isoniazid", "labetolol", "trovafloxacin", "tolcapone", "felbamate")